Clinical trial inclusion criterion:
Prior pelvic radiotherapy except as part of combination therapy for prostate cancer

Entity relations:
- Has_qualifier("radiotherapy", "pelvic")
- Has_temporal("radiotherapy", "Prior")
- AND("combination therapy", "prostate cancer")
- AND("combination therapy", "prostate cancer")
- Has_negation("combination therapy", "except")
- AND("radiotherapy", "combination therapy")